Clinical trial exclusion criterion:
Monoamine oxidase inhibitors (MAOi)

Annotated entities:
- Drug: "Monoamine oxidase inhibitors (MAOi)"